Have Chronic HCV infection prior to transplantation with documented HCV viremia = 1,000 IU/ml at screening and either documented HCV Ab positivity or HCV viremia = 1,000 IU/ml at least 6 months prior to enrollment.

The above is a clinical trial inclusion criterion. Annotated with entity spans:
Have [Condition: Chronic HCV infection] [Temporal: prior to transplantation] with documented [Measurement: HCV viremia] [Value: = 1,000 IU/ml] at screening and either documented [Measurement: HCV Ab] [Value: positivity] or [Measurement: HCV viremia] [Value: = 1,000 IU/ml] [Temporal: at least 6 months prior to enrollment.]